Clinical trial exclusion criterion:
DSM-V diagnosis of a lifetime history of psychotic spectrum disorder

Entity relations:
- Has_temporal("psychotic spectrum disorder", "lifetime history")
- Has_qualifier("psychotic spectrum disorder", "DSM-V")